Clinical trial exclusion criterion:
Linguistic barrier or psychological profile preventing the patient from signing the consent form.

Entity relations:
- Has_negation("signing the consent form", "preventing")
- AND("Linguistic barrier", "signing the consent form")
- OR("Linguistic barrier", "psychological profile")